use of any other investigational or non-registered drug or vaccine during the study period or within 30 days preceding the study vaccine

The above is a clinical trial exclusion criterion. Annotated with entity spans:
use of any other [Qualifier: investigational] or [Qualifier: non-registered] [Procedure: drug] or [Procedure: vaccine] [Temporal: during the study period] or [Temporal: within 30 days preceding the study vaccine]